Clinical trial exclusion criterion:
Patients with a history of drug abuse;

Entity relations:
- Has_temporal("drug abuse", "history")